Treatment with IV antibiotics in the 6 weeks prior to Visit 1

The above is a clinical trial exclusion criterion. Annotated with entity spans:
Treatment with [Drug: IV antibiotics] [Temporal: in the 6 weeks prior to Visit 1]